Señale la respuesta correcta respecto a los linfocitos B.
1. Sus dos principales subpoblaciones se denominan B-helper y B-citotóxicos.
2. Son las células encargadas de la producción de anticuerpos en el rechazo de un transplante   autólogo    de    progenitores hematopoyéticos.
3. Son las células diana del anticuerpo monoclonal anti-CD20 (rituximab).
4. Requieren la co-estimulación CD20-CD19 para la expresión de la molécula CD3 en su superficie.
5. Es el tipo de linfocito mayoritario en la sangre periférica de pacientes afectos de enfermedad de Bruton.

Respuesta correcta: 3. Son las células diana del anticuerpo monoclonal anti-CD20 (rituximab).